What disease is associated with a Malar rash?

The malar or butterfly rash is seen on the face and is associated with systemic Lupus erythematosus